Clinical trial inclusion criterion:
previous enrolment in this study

Annotated entities:
- Non-query-able: "previous enrolment in this study"